Clinical trial exclusion criterion:
Antibiotic use except study drugs

Entity relations:
- Has_negation("study drugs", "except")
- AND("Antibiotic", "study drugs")